pregnant or lactating women;

The above is a clinical trial exclusion criterion. Annotated with entity spans:
[Pregnancy_considerations: pregnant or lactating women];